Clinical trial exclusion criterion:
Serious or unstable medical or psychological conditions that would compromise the subject's safety for successful participation

Annotated entities:
- Non-query-able: "Serious or unstable medical or psychological conditions that would compromise the subject's safety for successful participation"